Clinical trial inclusion criterion:
Be between age 18 and 55 years

Entity relations:
- Has_value("age", "between 18 and 55 years")